Which histone mutation is associated with gliomas?

some of these molecular changes with clinicopathological utility have been used for the first time in the most recent edition of the world health organization (who) classification of cns tumours to define entities like ependymoma, rela fusion-positive or diffuse midline glioma, h3 k27m-mutant.